有關兒童尿床（nocturnal enuresis）的敘述，下列何者錯誤？
A. 續發性尿床（secondary enuresis）的小孩應考慮有無尿路感染的可能
B. 夜間多尿症（nocturnal polyuria）也是可能的原因之一
C. 可以使用血管增壓素（vasopressin）治療
D. 藥物治療無效的小孩，通常會有較大的夜間膀胱容量

正確答案：D. 藥物治療無效的小孩，通常會有較大的夜間膀胱容量